Clinical trial exclusion criterion:
American Heart Association class >3

Annotated entities:
- Measurement: "American Heart Association class"
- Value: ">3"